Clinical trial inclusion criterion:
Available at school for at least the first pharyngeal swab and willing to comply with study procedures

Annotated entities:
- Multiplier: "first"
- Procedure: "pharyngeal swab"
- Mood: "willing to"
- Observation: "comply with study procedures"